Clinical trial inclusion criterion:
Signed consent

Annotated entities:
- Informed_consent: "Signed consent"